下列何條肌肉纖維化是導致嬰孩肌肉性斜頸（muscular torticollis）的主因？
A. 斜方肌
B. 胸鎖乳突肌
C. 肩胛舌骨肌
D. 二腹肌

正確答案：B. 胸鎖乳突肌